Clinical trial exclusion criterion:
chronic, metabolic, systemic and endocrine disorders, including hyperandrogenism, hyperprolactinemia, diabetes mellitus and thyroid disease,

Entity relations:
- Subsumes("chronic disorders", "hyperandrogenism")
- AND("chronic disorders", "metabolic disorders")
- AND("metabolic disorders", "systemic disorders")
- AND("systemic disorders", "endocrine disorders")
- OR("hyperandrogenism", "thyroid disease", "hyperprolactinemia", "diabetes mellitus")